下列那一種疾病不是由 Epstein-Barr 病毒（EBV）引起的？
A. 毛狀口腔白斑病（Hairy oral leukoplakia）
B. 角膜結膜炎（Keratoconjunctivitis）
C. 傳染性單核球增多症（Infectious mononucleosis）
D. 伯奇氏淋巴瘤（Burkitt lymphoma）

正確答案：B. 角膜結膜炎（Keratoconjunctivitis）